Clinical trial inclusion criterion:
AND identical isolate in urine sample (>= 1.000 CFU) OR relevant clinical signs of UTI

Annotated entities:
- Value: "identical isolate"
- Procedure: "urine sample"
- Measurement: "CFU"
- Value: ">= 1.000"
- Mood: "clinical signs"
- Condition: "UTI"